Diagnosis of uncomplicated gastroschisis

The above is a clinical trial inclusion criterion. Annotated with entity spans:
Diagnosis of [Qualifier: uncomplicated] [Condition: gastroschisis]